Clinical trial exclusion criterion:
Absence of documentation in the medical record of clinical remission for the last 6 months

Entity relations:
- Has_temporal("clinical remission", "for the last 6 months")
- Has_negation("clinical remission", "Absence of")